Clinical trial inclusion criterion:
scheduled for urologic or orthopedic procedure necessitating intrathecal morphine

Annotated entities:
- Procedure: "orthopedic procedure"
- Procedure: "urologic procedure"
- Drug: "morphine"
- Qualifier: "intrathecal"